Clinical trial inclusion criterion:
Life expectancy of at least 12 months as per the investigator's judgement

Annotated entities:
- Observation: "Life expectancy"
- Value: "at least 12 months"